急診室接到救護車送來的一名年輕婦女，伴隨人員陳述該婦女因情感因素，一小時前在家中吞食通樂（內含氫氧化鈉、氨水等強鹼），下列緊急處置何者為宜？
A. 口腔黏膜損傷情形如果輕微，就不必安排食道檢查
B. 應立即給予催吐劑或酸性中和劑與洗胃
C. 靜脈輸液及鼻胃管進食
D. 應立即安排內視鏡檢查損傷範圍與程度

正確答案：C. 靜脈輸液及鼻胃管進食